NYHA III-IV heart function, or severe hepatic or renal insufficiency (Grade 4);

The above is a clinical trial exclusion criterion. Annotated with entity spans:
[Measurement: NYHA] [Value: III-IV] [Condition: heart function], or [Qualifier: severe] [Condition: hepatic] or [Condition: renal insufficiency] ([Qualifier: Grade 4]);